What are the indications for alteplase?

Intravenous alteplase (recombinant tissue plasminogen activator) is the only approved thrombolytic agent at present indicated for acute ischaemic stoke.
Food and Drug Administration approval of alteplase for central venous catheter (CVC) occlusions. 
Alteplase is now firmly established as a treatment of choice in the management of acute myocardial infarction. The efficacy of intravenous alteplase in the treatment of pulmonary thromboembolism has also been established and appears to be similar to that of streptokinase and urokinase in this indication and in arterial thrombotic occlusion. However, its use in this latter indication and in other vascular disorders has not been as extensively documented. 
Preliminary data suggest efficacy of alteplase of deep vein thrombosis and arterial thrombotic occlusion.